Clinical trial exclusion criterion:
Medications associated with female sexual dysfunction; Antidepressants opiates, beta blockers, Antiepileptics ( gabapentin, topiramate,phenytoin) benzodiazepines

Entity relations:
- Has_qualifier("Medications", "associated with female sexual dysfunction")
- Subsumes("Antiepileptics", "gabapentin")
- Subsumes("female sexual dysfunction", "Antidepressants")
- OR("Antidepressants", "opiates", "beta blockers", "Antiepileptics", "benzodiazepines")
- OR("gabapentin", "topiramate", "phenytoin")